Clinical trial inclusion criterion:
Written informed consent obtained prior to enrolling in roll-over study

Entity relations:
- Has_index("prior to enrolling in roll-over study", "enrolling in roll-over study")
- Has_temporal("Written informed consent", "prior to enrolling in roll-over study")